Clinical trial exclusion criterion:
History of taking coumadin or similar anticoagulant, have a known coagulopathy, bleeding dyscrasia, or platelet count < 150,000/cubic mm

Entity relations:
- Has_value("platelet count", "< 150,000/cubic mm")
- OR("coagulopathy", "bleeding dyscrasia", "platelet count")
- OR("coumadin", "anticoagulant")